What disease is presenilin involved in?

Loss-of-function mutations in PSEN1/2 genes are the leading cause of familial Alzheimer's disease (fAD).